Clinical trial exclusion criterion:
Medical condition whose pathology or treatment would significantly increase the risk associated with the proposed protocol.

Entity relations:
- Has_qualifier("Medical condition", "would significantly increase the risk associated with the proposed protocol")